下列有關肥大細胞（mast cells）的敘述，何者錯誤？
A. 是體內少數會分泌組織胺的細胞
B. 表面上有 IgE 抗體的受體
C. 會分泌 major basic protein 而毒殺寄生蟲
D. 主要分布在結締組織和黏膜

正確答案：C. 會分泌 major basic protein 而毒殺寄生蟲